Patients with a history of total or unicompartmental reconstruction of the affected joint

The above is a clinical trial exclusion criterion. Annotated with entity spans:
Patients with a history of [Qualifier: total] or [Qualifier: unicompartmental] [Procedure: reconstruction] of the [Qualifier: affected joint]